Aged 5 years to less than 12 years at Visit 1. At least 15 (25%) children of the total study population must be aged 5 to less than 8 years.

The above is a clinical trial inclusion criterion. Annotated with entity spans:
[Person: Aged] [Value: 5 years to less than 12 years] [Temporal: at Visit 1]. [Not_a_criteria: At least 15 (25%) children of the total study population must be aged 5 to less than 8 years.]